Respecto a las vacunaciones infantiles, ¿cuál de las siguientes afirmaciones es correcta?
1. Los prematuros deben ser vacunados de acuerdo a su edad corregida.
2. Las vacunas vivas atenuadas están generalmente contraindicadas en los niños inmunodeprimidos.
3. La vacuna triple vírica (sarampión, rubeola y parotiditis) está contraindicada en niños con alergia al huevo.
4. Las inmunoglobulinas interfieren con las vacunas inactivadas (muertas).

Respuesta correcta: 2. Las vacunas vivas atenuadas están generalmente contraindicadas en los niños inmunodeprimidos.